Clinical trial exclusion criteria:
Significant illness, trauma or surgical procedures.
Clinically significant laboratory abnormalities.
Clinically significant medical history

Annotated entities:
- Condition: "illness"
- Condition: "trauma"
- Procedure: "surgical procedures"
- Qualifier: "Significant"
- Subjective_judgement: "Significant"
- Condition: "laboratory abnormalities"
- Procedure: "laboratory"
- Qualifier: "Clinically significant"
- Subjective_judgement: "Clinically significant"
- Temporal: "medical history"
- Qualifier: "Clinically significant"